Drug/alcohol abuse: Subjects with a known or suspected history of alcohol or drug abuse within the last 2 years.

The above is a clinical trial exclusion criterion. Annotated with entity spans:
[Drug: Drug]/[Drug: alcohol abuse]: Subjects with a known or suspected [Temporal: history] of [Drug: alcohol] or [Drug: drug abuse] [Temporal: within the last 2 years].